Clinical trial exclusion criteria:
Allergy to Glitazones
Myocardial infarction
Heart failure
Angina
History of kidney stones
Liver disease (abnormal liver enzymes)
Anemia (hemoglobin <8 g/dl)
Cancer with current treatment
Previous organ transplantation
Immunosuppressant therapy
Human immunodeficiency virus infection
Pregnancy or lactating
Current tobacco use
Dilantin and oral contraceptive usage due to potential drug interaction with glitazones
Self-identified history of hypoglycemia

Annotated entities:
- Drug: "Glitazones"
- Condition: "Allergy"
- Condition: "Myocardial infarction"
- Condition: "Heart failure"
- Condition: "Angina"
- Condition: "kidney stones"
- Temporal: "History"
- Condition: "Liver disease"
- Measurement: "liver enzymes"
- Value: "abnormal"
- Condition: "Anemia"
- Measurement: "hemoglobin"
- Value: "<8 g/dl"
- Condition: "Cancer"
- Procedure: "treatment"
- Temporal: "current"
- Temporal: "Previous"
- Procedure: "organ transplantation"
- Procedure: "Immunosuppressant therapy"
- Condition: "Human immunodeficiency virus infection"
- Condition: "Pregnancy"
- Condition: "lactating"
- Observation: "tobacco use"
- Temporal: "Current"
- Drug: "Dilantin"
- Drug: "oral contraceptive"
- Condition: "drug interaction"
- Drug: "glitazones"
- Mood: "potential"
- Condition: "hypoglycemia"
- Temporal: "history"
- Qualifier: "Self-identified"